Clinical trial exclusion criterion:
Active bleeding or high bleeding risk (severe liver failure, active peptic ulcer, creatinine clearance < 30 mL/min, platelets count < 100.000 mm3);

Annotated entities:
- Condition: "high bleeding risk"
- Condition: "bleeding"
- Qualifier: "Active"
- Condition: "liver failure"
- Qualifier: "severe"
- Qualifier: "active"
- Condition: "peptic ulcer"
- Measurement: "creatinine clearance"
- Value: "< 30 mL/min"
- Measurement: "platelets count"
- Value: "< 100.000 mm3"